Clinical trial inclusion criterion:
Patient has demonstrated compliance, as assessed by the investigator, with the parent study protocol requirements

Annotated entities:
- Observation: "compliance with the parent study protocol requirements"
- Non-representable: "as assessed by the investigator"